Patients under 18

The above is a clinical trial exclusion criterion. Annotated with entity spans:
Patients [Person: under 18]